Any disability acquired from trauma or another illness that could interfere with evaluation of disability due to MS

The above is a clinical trial exclusion criterion. Annotated with entity spans:
[Post-eligibility: Any disability acquired from trauma or another illness that could interfere with evaluation of disability due to MS]